李先生到醫院進行各項肺容積之測量，測量結果顯示總肺活量（total lung capacity）為 5800 毫升，餘容積（residual volume）為 1000 毫升，功能性肺餘容量（functional residual capacity）為 1800 毫升，潮 氣容積（tidal volume）為 500 毫升。李先生的呼氣儲備容積（expiratory reserve volume）為多少毫升？
A. 800
B. 1300
C. 1500
D. 2300

正確答案：A. 800